Clinical trial exclusion criterion:
Atrial fibrillation of new onset or when rate control has been difficult

Entity relations:
- Has_temporal("Atrial fibrillation", "new onset")
- OR("Atrial fibrillation", "rate control has been difficult")